Subjects who understand and voluntarily sign an informed consent form

The above is a clinical trial inclusion criterion. Annotated with entity spans:
[Post-eligibility: Subjects who understand and voluntarily sign an informed consent form]